Clinical trial exclusion criterion:
no history of allergy to drugs such as, but not limited to, sulphonamides and penicillins

Annotated entities:
- Temporal: "history"
- Condition: "allergy"
- Drug: "sulphonamides"
- Drug: "penicillins"